Clinical trial exclusion criterion:
Medication No use within the following time intervals prior to Screening or thereafter at any time during the study (unless otherwise specified) Inhaled Long acting beta-agonists (LABA) 48 hours ICS/LABA combination products 48 hours Inhaled corticosteroids 48 hours Tiotropium 1 week Systemic, Oral, parenteral, intra-articular corticosteroids 30 days (oral and systemic corticosteroids may be used to treat COPD exacerbations during the study) Cytochrome P450 3A4 strong inhibitors including but not limited to antiretrovirals (protease inhibitors) (e.g.Indinavir, Nelfinavir, Ritonavir, Saquinavir); Imidazole and Triazole anti-fungals (e.g. Ketaconazole, Itraconazole); Clarithromycin, Telithromycin, Amiodarone, and Nefazodone 6 weeks Grapefruit is allowed up to Visit 1, then limited to no more than one glass of grapefruit juice (250 mL/ 8 ounces) or one grapefruit per day Any other investigational drug 30 days or 5 half lives whichever is longer.

Annotated entities:
- Drug: "Inhaled Long acting beta-agonists (LABA)"
- Temporal: "48 hours"
- Reference_point: "Screening"
- Drug: "ICS/LABA combination products"
- Temporal: "48 hours"
- Drug: "Inhaled corticosteroids"
- Temporal: "48 hours"
- Drug: "Tiotropium"
- Temporal: "1 week"
- Drug: "corticosteroids"
- Qualifier: "Systemic"
- Qualifier: "Oral"
- Qualifier: "parenteral"
- Qualifier: "intra-articular"
- Temporal: "30 days"
- Drug: "corticosteroids"
- Qualifier: "oral"
- Qualifier: "systemic"
- Condition: "COPD exacerbations"
- Procedure: "treat COPD exacerbations"
- Temporal: "during the study"
- Reference_point: "the study"
- Not_a_criteria: "oral and systemic corticosteroids may be used to treat COPD exacerbations during the study"
- Drug: "Cytochrome P450 3A4 strong inhibitors"
- Drug: "Itraconazole"
- Drug: "Clarithromycin"
- Drug: "Telithromycin"
- Drug: "Amiodarone"
- Drug: "Nefazodone"
- Temporal: "6 weeks"
- Drug: "Grapefruit"
- Grammar_Error: "Grapefruit is allowed up to Visit 1"
- Drug: "investigational drug"
- Undefined_semantics: "investigational drug"
- Temporal: "30 days"
- Temporal: "5 half lives"
- Drug: "antiretrovirals"
- Drug: "protease inhibitors"
- Drug: "Indinavir"
- Drug: "Nelfinavir"
- Drug: "Ritonavir"
- Drug: "Saquinavir"
- Drug: "Imidazole anti-fungals"
- Drug: "Triazole anti-fungals"
- Drug: "Ketaconazole"
- Negation: "No"
- Reference_point: "any time during the study"